下列那種 corticosteroid 的抗發炎作用最強？
A. Aldosterone
B. Dexamethasone
C. Fludrocortisone
D. Desoxycorticosterone

正確答案：B. Dexamethasone